Clinical trial exclusion criteria:
Age< 18
Pregnancy
Bradycardia (HR<55bpm)
Systolic Blood Pressure < 80 mmHg / Mean arterial pressure < 50 mmHg on maximal support
Death imminent
Unlikely to survive 90 days
Acute liver failure
Dementia
High-grade block in the absence of a functioning pacemaker.

Annotated entities:
- Person: "Age"
- Value: "< 18"
- Condition: "Pregnancy"
- Condition: "Bradycardia"
- Measurement: "HR"
- Value: "<55bpm"
- Measurement: "Systolic Blood Pressure"
- Value: "< 80 mmHg"
- Measurement: "Mean arterial pressure"
- Value: "< 50 mmHg"
- Qualifier: "on maximal support"
- Procedure: "support"
- Condition: "Death"
- Temporal: "imminent"
- Non-representable: "Unlikely to survive 90 days"
- Condition: "Acute liver failure"
- Condition: "Dementia"
- Condition: "High-grade block"
- Negation: "in the absence of"
- Device: "pacemaker"
- Qualifier: "functioning"